Clinical trial exclusion criterion:
Women pregnant or lactating, or women planning to become pregnant

Annotated entities:
- Person: "Women"
- Condition: "pregnant"
- Condition: "lactating"
- Person: "women"
- Mood: "planning to become"
- Condition: "pregnant"